Clinical trial inclusion criterion:
Good symptom control

Annotated entities:
- Condition: "symptom control"
- Qualifier: "Good"